對正常初產婦而言，在無麻醉狀況下第二產程如果超過多少小時即可算過久？
A. 1 小時
B. 2 小時
C. 3 小時
D. 4 小時

正確答案：B. 2 小時